Clinical trial exclusion criterion:
pregnancy/ breastfeeding

Annotated entities:
- Pregnancy_considerations: "pregnancy/ breastfeeding"